Respecto a las características de los Antibióticos, ¿cuál es la afirmación correcta?:
1. La administración oral de Vancomicina es el tratamiento de elección en tratamiento de las infecciones respiratorias bacterianas graves.
2. Una de las ventajas de los Antibióticos Aminoglucósidos es su excelente biodisponibilidad tras la administración por vía oral.
3. Los Macrólidos actúan impidiendo la síntesis de Ácido Fólico en las bacterias.
4. Los Antibióticos Betalactámicos impiden la síntesis de la pared bacteriana.

Respuesta correcta: 4. Los Antibióticos Betalactámicos impiden la síntesis de la pared bacteriana.